Antecedent of epileptic seizure

The above is a clinical trial exclusion criterion. Annotated with entity spans:
[Temporal: Antecedent] of [Condition: epileptic seizure]